Clinical trial inclusion criterion:
Willingness and ability to attend scheduled follow-up visits and undergo study assessments.

Annotated entities:
- Mood: "ability to attend scheduled follow-up visits"
- Observation: "ability to undergo study assessments"
- Mood: "to attend scheduled follow-up visits Willingness"
- Observation: "to undergo study assessments Willingness"